Clinical trial inclusion criterion:
Highly active RMS as defined by:

Entity relations:
- Has_qualifier("RMS", "Highly active")